Clinical trial inclusion criterion:
Must have at least 6 mm of residual bone

Entity relations:
- Has_value("residual bone", "at least 6 mm")